76 人類食用含有囊狀幼蟲的水生植物，可能感染下列那些寄生蟲？①橫川異形吸蟲（Metagonimus yokogawai） ②薑片蟲（Fasciolopsis buski） ③牛羊肝吸蟲（Fasciola hepatica） ④衛氏肺吸蟲 （Paragonimus westermani）
A. ①③
B. ①④
C. ②③
D. ②④

正確答案：C. ②③